Clinical trial exclusion criterion:
Patients who have received a transplant besides liver.

Entity relations:
- Has_qualifier("transplant", "liver")